birth weight < 2500 g

The above is a clinical trial exclusion criterion. Annotated with entity spans:
[Measurement: birth weight] [Value: < 2500 g]